· creatinine ≤ 1.5 x ULN

The above is a clinical trial inclusion criterion. Annotated with entity spans:
· [Measurement: creatinine] [Value: ≤ 1.5 x ULN]